Clinical trial inclusion criterion:
intolerance of or allergy to ticagrelor or prasugrel

Annotated entities:
- Drug: "ticagrelor"
- Condition: "intolerance"
- Condition: "allergy"
- Drug: "prasugrel"